New York Heart Association (NYHA) heart function classification is I-II grade

The above is a clinical trial inclusion criterion. Annotated with entity spans:
[Measurement: New York Heart Association] ([Measurement: NYHA]) heart function classification is [Value: I-II grade]